手術後 6 星期，蔡先生再到門診，並主訴於每次飯後二、三十分鐘會有心悸（palpitation）、頭昏 （dizziness）、流汗（sweating）、腹絞痛（cramping abdominal pain）及腹瀉（diarrhea）等現象。下列那一項處置優先考慮？
A. antispasmodic medication
B. dietary advice and counseling that symptoms will probably abate
C. workup with neuroendocrine tumor
D. preparation for revision to Roux-en-Y anastomosis

正確答案：B. dietary advice and counseling that symptoms will probably abate